下列何者為德國麻疹病毒（Rubella virus）的致病機制？
A. 經消化道感染柱狀上皮細胞
B. 先在呼吸道增殖，再感染網狀內皮系統
C. 經蚊子叮咬直接產生病毒血症
D. 先在肌肉增殖，並擴散到中樞神經

正確答案：B. 先在呼吸道增殖，再感染網狀內皮系統